一位35歲男性發生車禍受傷，造成頸部疼痛、無法行走。經送往急診室，初步理學檢查顯示生命跡象穩定，意識清楚，右側上下肢肌力為5分，但痛覺和溫度感覺喪失，左側上下肢肌力為0分，但溫痛感覺正常，電腦斷層影像顯示第四頸椎骨折、神經壓迫。則此患者最有可能是下列何種脊髓損傷？
A. 前側脊髓症候群（anterior cord syndrome）
B. 布朗賽卡氏症候群（Brown-Séquard syndrome）
C. 中央脊髓症候群（central cord syndrome）
D. 後側脊髓症候群（posterior cord syndrome）

正確答案：B. 布朗賽卡氏症候群（Brown-Séquard syndrome）